Current haemodialysis or peritoneal dialysis

The above is a clinical trial exclusion criterion. Annotated with entity spans:
[Temporal: Current] [Procedure: haemodialysis] or [Procedure: peritoneal dialysis]